在臺灣，胎兒水腫（hydrops fetalis）最常見的原因為甲型海洋性貧血（alpha-thalassemia）。請問其致病基因在第幾對染色體？
A. 8
B. 11
C. 13
D. 16

正確答案：D. 16